Clinical trial inclusion criterion:
Be willing to participate in a smoking cessation program

Annotated entities:
- Mood: "willing to participate"
- Procedure: "smoking cessation program"